6. Haematologic function as follows (5% deviation allowed):

The above is a clinical trial inclusion criterion. Annotated with entity spans:
[Parsing_Error: 6.] [Parsing_Error: Haematologic function as follows (5% deviation allowed):]